Use of antidiabetic drugs other than metformin within 3 months prior to screening.

The above is a clinical trial exclusion criterion. Annotated with entity spans:
Use of [Drug: antidiabetic drugs] [Negation: other than] [Drug: metformin] [Temporal: within 3 months prior to screening].